Clinical trial exclusion criteria:
Subject who showed medically significant adverse events or intolerance with aripiprazole during screening period or as prior experiences.
Subjects with a current DSM-<U+2163>-TR or 5 diagnosis other than schizophrenia, including schizoaffective disorder, major depressive disorder, bipolar disorder, delirium, dementia, amnesia, Borderline, Paranoid, Histrionic, Schizotypal, Schizoid, Antisocial or other cognitive or personality disorders.
Subjects with diseases of the central nervous system that may impact the assessment of the psychotic symptoms as per investigator's opinion.
Subjects who have been treated with clozapine or long-acting injectable antipsychotic drugs within 3 months prior to the screening.
Subjects who have been treated over maximum maintenance dose (as specified in each label) of oral antipsychotics at screening. (e.g. Aripiprazole>30mg/day, Olanzapine>20mg/day, Risperidone > 6mg/day, Quetiapine > 750mg/day)
Subjects with a significant risk of violent behaviour or a significant risk of committing suicide based on history or investigator's judgment.
Subjects had a history of seizures, neuroleptic malignant syndrome, clinically significant tardive dyskinesia, or other medical condition that would expose them to undue risk or interfere with study assessments.
Significant history of drug abuse disorder (including alcohol, as defined in DSM-5 substance use disorder or in the opinion of the investigator) within the last 6 months prior to screening.
Subjects participating another interventional clinical trial within 30 days prior to screening.
Women who are pregnant, nursing, or who plan to become pregnant while in the trial.
Subjects having any other clinically significant finding of the physical examination or laboratory value that make investigator consider that it would be inappropriate to participate in this study.

Annotated entities:
- Condition: "intolerance"
- Condition: "adverse events"
- Qualifier: "medically significant"
- Drug: "aripiprazole"
- Temporal: "during screening period"
- Temporal: "as prior experiences"
- Qualifier: "DSM-<U+2163>-TR"
- Condition: "schizophrenia"
- Negation: "other than"
- Qualifier: "DSM- 5"
- Condition: "schizoaffective disorder"
- Condition: "major depressive disorder"
- Condition: "bipolar disorder"
- Condition: "delirium"
- Condition: "dementia"
- Condition: "amnesia"
- Condition: "Borderline disorders"
- Condition: "Paranoid disorders"
- Condition: "Histrionic disorders"
- Condition: "Schizotypal disorders"
- Condition: "Schizoid disorders"
- Condition: "Antisocial disorders"
- Qualifier: "other"
- Condition: "cognitive disorders"
- Condition: "personality disorders"
- Post-eligibility: "Subjects with diseases of the central nervous system that may impact the assessment of the psychotic symptoms as per investigator's opinion."
- Drug: "clozapine"
- Drug: "long-acting injectable antipsychotic drugs"
- Temporal: "within 3 months prior to the screening"
- Reference_point: "the screening"
- Multiplier: "maximum maintenance dose"
- Drug: "oral antipsychotics"
- Temporal: "at screening"
- Drug: "Aripiprazole"
- Drug: "Olanzapine"
- Drug: "Risperidone"
- Drug: "Quetiapine"
- Value: "> 750mg/day"
- Value: "> 6mg/day"
- Value: ">20mg/day"
- Value: ">30mg/day"
- Observation: "violent behaviour"
- Condition: "committing suicide"
- Mood: "significant risk"
- Mood: "significant risk"
- Condition: "seizures"
- Condition: "neuroleptic malignant syndrome"
- Qualifier: "clinically significant"
- Condition: "tardive dyskinesia"
- Non-representable: "or other medical condition that would expose them to undue risk or interfere with study assessments"
- Temporal: "history"
- Intoxication_considerations: "Significant history of drug abuse disorder (including alcohol, as defined in DSM-5 substance use disorder or in the opinion of the investigator) within the last 6 months prior to screening."
- Competing_trial: "Subjects participating another interventional clinical trial within 30 days prior to screening."
- Pregnancy_considerations: "Women who are pregnant, nursing, or who plan to become pregnant while in the trial."
- Post-eligibility: "Subjects having any other clinically significant finding of the physical examination or laboratory value that make investigator consider that it would be inappropriate to participate in this study."